general anesthesia

The above is a clinical trial exclusion criterion. Annotated with entity spans:
[Procedure: general anesthesia]